Clinical trial exclusion criterion:
Patient with contraindication to misoprostol or vasopressin, personal history or cardiac or pulmonary disease, history of prior myomectomy

Entity relations:
- AND("contraindication", "misoprostol")
- Has_temporal("myomectomy", "prior")
- Has_temporal("myomectomy", "history")
- Has_temporal("pulmonary disease", "personal history")
- OR("misoprostol", "vasopressin")
- OR("pulmonary disease", "disease cardiac")
- OR("contraindication", "personal history", "history")